Clinical trial inclusion criterion:
ALT < 10 x the upper limit of normal (ULN)

Annotated entities:
- Measurement: "ALT"
- Value: "< 10 x the upper limit of normal (ULN)"